El número de nodos del LUMO (orbital desocupado de menor energía) del 1,3-butadieno es:
1. Ninguno.
2. Uno.
3. Dos.
4. Tres.
5. Cuatro.

Respuesta correcta: 3. Dos.